Clinical trial exclusion criterion:
tortuousity (greater than 60 degree angle) that makes it unsuitable for proper stent delivery and deployment,

Entity relations:
- Has_value("angle", "greater than 60 degree")
- Subsumes("tortuousity", "angle")
- Has_qualifier("stent delivery and deployment", "unsuitable for proper")
- causal("tortuousity", "stent delivery and deployment")